What does A1C measure?

The A1C measures the amount of glycated hemoglobin in the blood and is a marker for control of blood glucose. Poor glucose control is indicative of diabetes mellitus.